Clinical trial exclusion criterion:
acute or unstable medical disease,

Entity relations:
- Has_qualifier("medical disease", "acute")
- OR("acute", "unstable")